下列何種抗生素須併用cilastatin，以避免被腎臟之dehydropeptidase水解破壞？
A. imipenem
B. minocycline
C. sulfamethoxazole
D. tobramycin

正確答案：A. imipenem